正常的食道在食道攝影中，通常有三處狹窄之處，下列何者正確？ ①鄰近左心房處 ②在會厭軟骨附近 ③近橫膈膜處 ④近主動脈或氣管分岔處
A. ①②③
B. ②③④
C. ①③④
D. ①②④

正確答案：B. ②③④